Clinical trial inclusion criterion:
At least two cases in the family

Annotated entities:
- Multiplier: "At least two"
- Undefined_semantics: "cases in the family"
- Parsing_Error: "cases in the family"